La complicación más frecuente de una fractura de olecranon intervenida y tratada con osteosíntesis tipo cerclaje/tirante (Obenque) es:
1. Neuritis nervio cubital.
2. Osificación heterotópica.
3. Molestias derivadas del material de síntesis implantado.
4. Limitación de la flexión del codo.

Respuesta correcta: 3. Molestias derivadas del material de síntesis implantado.